Clinical trial inclusion criterion:
CAD:Presence of any one of the following: Angina plus positive exercise tolerance test, enzyme and/or Q wave positive myocardial infarction, angiographic evidence ( >50% stenosis of one vessel), percutaneous or surgical coronary revascularisation.

Annotated entities:
- Condition: "CAD"
- Condition: "Angina"
- Measurement: "exercise tolerance test"
- Value: "positive"
- Qualifier: "Q wave positive"
- Condition: "myocardial infarction"
- Qualifier: "enzyme positive"
- Condition: "angiographic evidence"
- Value: ">50%"
- Measurement: "stenosis of one vessel"
- Qualifier: "surgical"
- Qualifier: "percutaneous"
- Procedure: "coronary revascularisation"